smokers

The above is a clinical trial exclusion criterion. Annotated with entity spans:
[Observation: smokers]